下列何構造不位於中腦（midbrain）？
A. 上小腦腳交叉（superior cerebellar peduncle decussation）
B. 黑質（substantia nigra）
C. 內側膝狀體（medial geniculate body）
D. 下丘（inferior colliculus）

正確答案：C. 內側膝狀體（medial geniculate body）